¿Cual     de     las   substancias   vasoactivas mencionadas contrae preferentemente las arteriolas eferentes glomerulares en la mayoría de estados fisiológicos?
1. Adrenalina.
2. Noradrenalina.
3. Endotelina.
4. Angiotensina II.
5. Bradicinina.

Respuesta correcta: 4. Angiotensina II.